化膿性關節炎是兒科病人的急症之一，需要快速診斷及治療。下列那一種關節炎若未迅速診斷引流與抗生素治療，易引起缺血性骨頭壞死（Avascular necrosis）？
A. Hip
B. Elbow
C. Knee
D. Ankle

正確答案：A. Hip